Clinical trial exclusion criterion:
Any cases converted to abdominal hysterectomy or other additional elective surgical procedures performed at time of abdominal myomectomy will be excluded from data analysis

Annotated entities:
- Procedure: "abdominal hysterectomy"
- Mood: "converted to"
- Qualifier: "elective"
- Procedure: "surgical procedures"
- Temporal: "at time of abdominal myomectomy"
- Reference_point: "abdominal myomectomy"
- Procedure: "abdominal myomectomy"
- Qualifier: "additional"
- Qualifier: "other"